¿Qué tipo de cadenas laterales de los aminoácidos competirán con los iones salinos por el agua de solvatación?:
1. Apolares.
2. Alifáticas.
3. Aromáticas.
4. Polares.
5. Sin carga.

Respuesta correcta: 4. Polares.